Failure of conservative treatment for at least 3 months;

The above is a clinical trial inclusion criterion. Annotated with entity spans:
[Observation: Failure] of [Procedure: conservative treatment] [Temporal: for at least 3 months];